Clinical trial exclusion criterion:
IBS subtype with constipation

Annotated entities:
- Condition: "IBS subtype"
- Condition: "constipation"